關於 Neurogenic tumor 的描述，何者錯誤？
A. 是兒童最常見的縱膈腔腫瘤
B. 好發於後縱膈腔
C. 成人以惡性腫瘤居多，兒童以良性腫瘤居多
D. 良性腫瘤的治療以手術切除為主

正確答案：C. 成人以惡性腫瘤居多，兒童以良性腫瘤居多